Clinical trial exclusion criterion:
Hepatic insufficiency (Child-Pugh score > 5)

Annotated entities:
- Condition: "Hepatic insufficiency"
- Measurement: "Child-Pugh score"
- Value: "> 5"